Clinical trial exclusion criterion:
Ongoing therapy with any of the following: Systemic corticosteroids. Short course less than or equal to 21 days of corticosteroids is allowed; Systemic chemotherapeutic agents; Nephrotoxic systemic agents, including aminoglycosides, amphotericin B, cidofovir, cisplatin, foscarnet, pentamidine; Immunomodulatory treatments including Interleukin-2; Investigational agents

Annotated entities:
- Temporal: "Ongoing"
- Procedure: "therapy"
- Drug: "Systemic corticosteroids"
- Multiplier: "Short course"
- Multiplier: "less than or equal to 21 days"
- Condition: "corticosteroids"
- Negation: "is allowed"
- Drug: "Systemic chemotherapeutic agents"
- Drug: "Nephrotoxic systemic agents"
- Drug: "aminoglycosides"
- Drug: "amphotericin B"
- Drug: "cidofovir"
- Drug: "cisplatin"
- Drug: "foscarnet"
- Drug: "pentamidine"
- Procedure: "Immunomodulatory treatments"
- Drug: "Interleukin-2"
- Drug: "Investigational agents"